Clinical trial exclusion criterion:
Carrier of prosthetic mesh in the ostomy

Annotated entities:
- Device: "prosthetic mesh"
- Procedure: "ostomy"